Clinical trial exclusion criterion:
History of allergic reaction to study medications

Annotated entities:
- Condition: "allergic"
- Non-query-able: "History of allergic reaction to study medications"